Clinical trial exclusion criterion:
age less than 18 years old

Annotated entities:
- Person: "age"
- Value: "less than 18 years old"